Clinical trial exclusion criterion:
Need for 10% glucose solution

Annotated entities:
- Mood: "Need for"
- Drug: "10% glucose solution"